Clinical trial exclusion criterion:
4. Have undergone bilateral mastectomy

Annotated entities:
- Procedure: "bilateral mastectomy"